一個新生兒以真空吸引器輔助娩出後，頭顳葉與枕部發現一腫塊，它摸起來像水袋樣有波動，而且跨越骨縫。 身體診察發現前囟門無突出，血壓40/25 mmHg、心跳每分鐘190次，無神經學異常，下列何者為最可能之診斷？
A. 帽狀腱膜下血腫（Subgaleal  hemorrhage）
B. 硬膜上出血（Epidural hemorrhage）
C. 胎頭血腫（Cephalohematoma）
D. 胎頭產瘤（Caput succedaneum）

正確答案：A. 帽狀腱膜下血腫（Subgaleal  hemorrhage）